10 歲男童 3 週前發生咽炎（pharyngitis），血清檢查發現 anti-streptolysin O 及 DNAase B 有明顯升高，胸部聽診有明顯心包囊摩擦雜音（fraction rub），另有心搏過快及心律不整，下列病理變化中，何者最能代表此病人的心臟疾病？
A. 嗜伊紅性心肌炎（Eosinophilic myocarditis）
B. 感染性心內膜炎（Infective endocarditis）
C. 肉芽腫性心外膜炎（Granulomatous pericarditis）
D. 心肌炎併局部類纖維蛋白壞死（Myocarditis with focal fibrinoid necrosis）

正確答案：D. 心肌炎併局部類纖維蛋白壞死（Myocarditis with focal fibrinoid necrosis）